Clinical trial inclusion criterion:
All subjects will be in good general health and able to participate in the LP and imaging exams. This determination is made by the study neurologist and reviewed at a consensus meeting for each subject.

Annotated entities:
- Condition: "good general health"
- Observation: "able to participate"
- Procedure: "imaging exams"
- Procedure: "LP"
- Non-representable: "This determination is made by the study neurologist and reviewed at a consensus meeting for each subject."